Clinical trial exclusion criterion:
history of an invasive malignancy (other than this prostate cancer,or basal or squamous skin cancers) within prior 5 years

Entity relations:
- Has_negation("prostate cancer", "other than")
- Has_temporal("invasive malignancy", "within prior 5 years")
- OR("prostate cancer", "basal skin cancers", "squamous skin cancers")